Clinical trial exclusion criterion:
Major psychiatric disorder that is not adequately controlled by treatment

Entity relations:
- Has_qualifier("psychiatric disorder", "Major")
- Has_negation("adequately controlled", "not")
- Has_qualifier("psychiatric disorder", "adequately controlled")